Clinical trial inclusion criterion:
Absence of untreated caries.

Entity relations:
- Has_qualifier("caries", "untreated")
- Has_negation("caries", "Absence")